Clinical trial exclusion criterion:
Medical conditions complicating pregnancy.

Annotated entities:
- Condition: "Medical conditions"
- Qualifier: "complicating pregnancy"